Clinical trial exclusion criterion:
Allergy to povidone iodine.

Annotated entities:
- Condition: "Allergy"
- Drug: "povidone iodine"